Clinical trial inclusion criterion:
BMI less than 35

Annotated entities:
- Measurement: "BMI"
- Value: "less than 35"